Un niño con intolerancia al gluten pregunta a la enfermera qué chucherías puede tomar cuando sale a jugar con sus amigos:
1. Snacks.
2. Chocolates.
3. Palomitas de maíz.
4. Bollería.
5. Caramelos.

Respuesta correcta: 3. Palomitas de maíz.